Clinical trial exclusion criterion:
2. type 1 diabetes;

Annotated entities:
- Condition: "type 1 diabetes"